Clinical trial inclusion criterion:
SLEDAI >/= 6 at screening visit

Annotated entities:
- Measurement: "SLEDAI"
- Value: ">/= 6"
- Temporal: "at screening visit"
- Reference_point: "screening visit"